Clinical trial exclusion criterion:
Recto-vaginal fistula

Annotated entities:
- Condition: "Recto-vaginal fistula"